Clinical trial exclusion criterion:
History of severe untreated asthma, anaphylactic reactions or severe urticaria and/or angioedema

Entity relations:
- Has_qualifier("urticaria", "severe")
- Has_qualifier("asthma", "untreated")
- Has_qualifier("asthma", "severe")
- OR("asthma", "anaphylactic reactions", "urticaria", "angioedema")